4. vaginal bleeding or

The above is a clinical trial exclusion criterion. Annotated with entity spans:
4. [Condition: vaginal bleeding] [Parsing_Error: or]